4歲男孩，因走路容易跌倒及爬樓梯有困難而就診，而且無法很順利的由椅子站起來，需要雙手幫忙，抽血發現血中CK（Creatine kinase）濃度為18,000 IU/L，過去史顯示3歲以前發展里程碑是正常的，本病例最可能的 診斷是：
A. Charcot-Marie-Tooth disease
B. Duchenne muscular dystrophy
C. Myotonic dystrophy
D. Spinal muscular atrophy

正確答案：B. Duchenne muscular dystrophy